Clinical trial inclusion criterion:
Initial radiotherapy field of treatment to encompass greater than or equal to 30% of the esophagus

Annotated entities:
- Qualifier: "esophagus"
- Multiplier: "greater than 30"
- Multiplier: "equal to 30%"
- Measurement: "radiotherapy"
- Qualifier: "Initial"